Clinical trial inclusion criterion:
1. Male or female of any race, at least 18 years of age at Visit 1 Screening.

Entity relations:
- Has_value("age", "at least 18 years")
- Has_index("at Visit 1 Screening", "Visit 1 Screening")
- Has_temporal("age", "at Visit 1 Screening")
- OR("Male", "female")